At least 20/200 corrected visual acuity

The above is a clinical trial inclusion criterion. Annotated with entity spans:
[Value: At least 20/200] [Measurement: corrected visual acuity]